Clinical trial exclusion criterion:
Presence of psychiatric/ mental disorder or any other medical disorder which might impair the patient's ability to give informed consent or to comply with the requirements of the study protocol.

Annotated entities:
- Condition: "psychiatric disorder"
- Condition: "mental disorder"
- Condition: "other medical disorder"
- Undefined_semantics: "other medical disorder"
- Observation: "impair the patient's ability to give informed consent"
- Post-eligibility: "Presence of psychiatric/ mental disorder or any other medical disorder which might impair the patient's ability to give informed consent or to comply with the requirements of the study protocol."